Clinical trial exclusion criterion:
Unwillingness or inability to comply with the procedures described in this protocol

Annotated entities:
- Non-query-able: "Unwillingness or inability to comply with the procedures described in this protocol"